Alternative treatment for low back pain in previous two weeks

The above is a clinical trial exclusion criterion. Annotated with entity spans:
[Qualifier: Alternative] [Procedure: treatment] for [Condition: low back pain] [Temporal: in previous two weeks]